Clinical trial inclusion criterion:
3. Patients with chronic heart failure (NYHA class II or III);

Entity relations:
- Has_value("NYHA", "class II or III")
- AND("chronic heart failure", "NYHA")